Clinical trial inclusion criterion:
Illiteracy

Annotated entities:
- Observation: "Illiteracy"